Left Bundle Branch Block

The above is a clinical trial exclusion criterion. Annotated with entity spans:
[Condition: Left Bundle Branch Block]